Clinical trial exclusion criterion:
Patient has both clinically significant findings and unexplained clinically significant alarm symptoms

Annotated entities:
- Condition: "clinically significant findings"
- Qualifier: "unexplained"
- Condition: "clinically significant alarm symptoms"